Por reacción catalizada por acido de cetonas o aldehídos con aminas primarias se forman:
1. Lactonas.
2. Oximas.
3. Iminas.
4. Hidrazonas.

Respuesta correcta: 3. Iminas.